Secondary knee osteoarthritis

The above is a clinical trial exclusion criterion. Annotated with entity spans:
[Qualifier: Secondary] [Condition: knee osteoarthritis]